懷孕或長期服用避孕藥的婦女作手術時，使用下列何種神經肌肉阻斷劑時需特別謹慎小心？
A. Alcuronium
B. Doxacurium
C. Pancuronium
D. Succinylcholine

正確答案：D. Succinylcholine